局部使用下列何種藥物可作散瞳劑和解除鼻塞？
A. Atropine
B. Phenylephrine
C. Clonidine
D. Yohimbine

正確答案：B. Phenylephrine